Age less than 18

The above is a clinical trial exclusion criterion. Annotated with entity spans:
[Person: Age] [Value: less than 18]